Drivers and dangerous machine operators

The above is a clinical trial exclusion criterion. Annotated with entity spans:
[Person: Drivers] [Grammar_Error: and] [Person: dangerous machine operators]